Which drugs are included in the Qtern pill?

Qtern pill includes saxagliptin and dapagliflozin. It is indicated in the EU for the improvement of glycaemic control in adults with type 2 diabetes mellitus.